Clinical trial exclusion criterion:
(4)Diagnosis or suspicion of secondary hypertension;

Entity relations:
- Has_mood("secondary hypertension", "Diagnosis")
- OR("Diagnosis", "suspicion")